Clinical trial exclusion criterion:
Body mass index > 35

Annotated entities:
- Measurement: "Body mass index"
- Value: "> 35"